Clinical trial inclusion criterion:
Degenerative Disc Disease (as defined by neck pain of discogenic origin with degeneration of the disc confirmed by patient history and radiographic studies)

Annotated entities:
- Condition: "Degenerative Disc Disease"
- Condition: "neck pain"
- Qualifier: "discogenic origin"
- Condition: "degeneration of the disc"
- Temporal: "patient history"
- Procedure: "radiographic studies"